Patients currently on chemotherapy or with other primary cancers requiring systemic or hepatic loco-regional treatment.

The above is a clinical trial exclusion criterion. Annotated with entity spans:
Patients [Temporal: currently] on [Procedure: chemotherapy] or with [Qualifier: other] [Condition: primary cancers] requiring [Procedure: systemic] or [Procedure: hepatic loco-regional treatment].